¿En qué situación clínica emplearía            un tratamiento antimicrobiano combinado?
1. En una faringoamigdalitis aguda en un niño.
2. En una neumonía comunitaria por Mycoplasma pneumoniae en un adolescente.
3. En una meningitis aguda en un paciente anciano.
4. En una paciente postmenopáusica con una infección urinaria recidivante.
5. En un absceso cutáneo en una paciente joven.

Respuesta correcta: 3. En una meningitis aguda en un paciente anciano.